Clinical trial inclusion criterion:
Is between 18 and 40 years of age (inclusive)

Annotated entities:
- Value: "between 18 and 40 years (inclusive)"
- Person: "age"